根據行政院衛生署 95 年公告之「研究用人體檢體採集與使用注意事項」，有關採集胎兒檢體之同意規定，下列何者正確？
A. 只需經其母親同意
B. 需經其母親及父親（若可知道）之同意
C. 需經其母親或父親（若可知道）之同意
D. 需經其母親或父親（若可知道）之同意，並經兩位產科醫師認可

正確答案：A. 只需經其母親同意